What is BioCreative?

A community wide effort to evaluate biomedical information extraction and text mining.